Clinical trial exclusion criterion:
Patients with chronic respiratory failure

Annotated entities:
- Condition: "chronic respiratory failure"